Clinical trial inclusion criterion:
Subjects that have an indwelling CICC and are transitioning to a PICC for long-term IV access

Annotated entities:
- Device: "indwelling CICC"
- Observation: "transitioning to a PICC"
- Device: "PICC"